Patients under 18 years or inability to consent

The above is a clinical trial exclusion criterion. Annotated with entity spans:
Patients [Value: under 18] [Person: years] or [Condition: inability to consent]